Clinical trial exclusion criterion:
Immunosuppressive therapy, including cytotoxic agents within 14 days of first dose of 852A (nitrosoureas within 30 days of first dose)

Annotated entities:
- Procedure: "Immunosuppressive therapy"
- Drug: "cytotoxic agents"
- Temporal: "within 14 days of first dose"
- Drug: "852A"
- Drug: "nitrosoureas"
- Temporal: "within 30 days of first dose"